Se lleva a cabo un estudio para evaluar la relación entre el cáncer de pulmón y la exposición al sílice. Se seleccionan 400 pacientes con diagnóstico de cáncer de pulmón del registro provincial de tumores y se eligen 400 personas sanas de forma aleatoria de la población residente en la provincia. El resultado de la evaluación de esta relación es OR = 1,67; IC95% = 1,27 - 2,21. Es cierto:
1. No hay relación entre la exposición al sílice y el cáncer de pulmón.
2. Con este estudio no se puede evaluar la relación entre el sílice y el cáncer de pulmón.
3. Se trata de un estudio experimental aleatorizado con una asociación positiva entre la exposición al sílice y el cáncer de pulmón.
4. Estos datos muestran que no hay significación estadística entre la exposición al sílice y el cáncer de pulmón.
5. Se trata de un estudio de casos y controles con una asociación positiva entre la exposición al sílice y el cáncer de pulmón.

Respuesta correcta: 5. Se trata de un estudio de casos y controles con una asociación positiva entre la exposición al sílice y el cáncer de pulmón.